Clinical trial exclusion criterion:
American Society of Anesthesiologists physical-health status classification (ASA-PS)>3

Annotated entities:
- Measurement: "American Society of Anesthesiologists physical-health status classification (ASA-PS)"
- Value: ">3"